No periodontitis (Community Periodontal Index score = 0).

The above is a clinical trial inclusion criterion. Annotated with entity spans:
[Negation: No] [Condition: periodontitis] ([Measurement: Community Periodontal Index score] [Value: = 0]).